List phagosomal markers.

Rab7
LAMP1
Cathepsin D
Rab9
V-ATPase 
CD63